full term

The above is a clinical trial inclusion criterion. Annotated with entity spans:
[Condition: full term]